Clinical trial inclusion criterion:
Healthy children aged 6 months to 72 months

Annotated entities:
- Condition: "Healthy"
- Person: "children"
- Person: "aged"
- Value: "6 months to 72 months"